Clinical trial inclusion criterion:
To understand the impossibility of participating in another clinical trial during the time of participation in the study, until 6 months after its conclusion;

Annotated entities:
- Non-query-able: "To understand the impossibility of participating in another clinical trial during the time of participation in the study, until 6 months after its conclusion;"
- Post-eligibility: "To understand the impossibility of participating in another clinical trial during the time of participation in the study, until 6 months after its conclusion;"